下列何類藥物，無法藉由促進房水排出的機轉來降低眼壓？
A. 前列腺素（prostaglandin）
B. 縮瞳劑（miotics）
C. alpha-受體促效劑（α-agonist）
D. beta-受體阻斷劑（β-blocker）

正確答案：D. beta-受體阻斷劑（β-blocker）